Clinical trial inclusion criterion:
the resected lesion must have been well differentiated and confined to the mucosa (m2 maximum) on histological analysis,

Annotated entities:
- Condition: "resected lesion"
- Qualifier: "well differentiated"
- Qualifier: "confined to the mucosa"
- Qualifier: "m2 maximum"
- Procedure: "histological analysis"